Angiographically defined total occlusion over 3 months

The above is a clinical trial inclusion criterion. Annotated with entity spans:
[Qualifier: Angiographically defined] [Condition: total occlusion] over [Temporal: 3 months]